Clinical trial exclusion criterion:
Congestive heart failure or coronary artery disease

Entity relations:
- OR("Congestive heart failure", "coronary artery disease")